Paciente de 45 años en estudio por posible meningitis, con fiebre, cefalea y vómitos de 2 días de evolución. Le realizan una RM cerebral y una punción lumbar. Veinte horas después, al levantarse para ir al baño, se queja de cefalea intensa, muy marcada al incorporarse pero que desaparece al tumbarse. Ya no presenta fiebre ni vómitos. No puede caminar. ¿Cuál es con más probabilidad el origen de esta cefalea?
1. La meningitis sigue siendo la causa fundamental de su cefalea, pues es el mismo tipo de cefalea que al inicio de los síntomas.
2. Es una cefalea post-punción lumbar.
3. Hay que buscar una causa diferente a esta cefalea, pues no es típica del síndrome postpunción lumbar ni de la meningitis.
4. Lo más probable es que no fuera una meningitis viral, sino una hemorragia subaracnoidea. Por este motivo, la cefalea inicial desaparece casi completamente al tumbarse.

Respuesta correcta: 2. Es una cefalea post-punción lumbar.